Aged between 18 and 40 years

The above is a clinical trial inclusion criterion. Annotated with entity spans:
[Person: Aged] [Value: between 18 and 40 years]